某憂鬱症患者M，最近因投資失利，病情惡化，產生精神病症狀，接受住院治療。於病情改善出院時，M希望能夠藉由身心障礙補助來改善其經濟狀況，因此要求主治醫師P為其進行身心障礙鑑定時，把情況寫得嚴重一點。在此個案中，P會遭遇那兩個倫理原則之衝突？
A. 尊重自主原則與不傷害原則
B. 正義原則與不傷害原則
C. 正義原則與行善原則
D. 尊重自主原則與行善原則

正確答案：C. 正義原則與行善原則